Has a history of (non-infectious) pneumonitis that required steroids or current pneumonitis.

The above is a clinical trial exclusion criterion. Annotated with entity spans:
Has a [Temporal: history] of (non-infectious) [Condition: pneumonitis] that [Qualifier: required steroids] or [Temporal: current] [Condition: pneumonitis].